Clinical trial inclusion criterion:
Age group = 18 ys.

Annotated entities:
- Person: "Age group"
- Value: "= 18 ys"